Clinical trial inclusion criterion:
Parents able to provide written informed consent and adolescents must additionally provide assent.

Entity relations:
- Has_context("Parents", "provide written informed consent")
- Has_context("adolescents", "provide assent")